頭部外傷時，顱骨 pterion 部分有壓迫性骨折，極易造成那一條血管損害，導致出血？
A. 內頸動脈（internal carotid artery）
B. 中大腦動脈（middle cerebral artery）
C. 乙狀竇（sigmoid sinus）
D. 中腦膜動脈（middle meningeal artery）

正確答案：D. 中腦膜動脈（middle meningeal artery）